下列常見的 NSAIDs 中，何者是 selective COX-2 阻斷劑？
A. aspirin
B. celecoxib
C. ketorolac
D. indomethacin

正確答案：B. celecoxib